Clinical trial exclusion criterion:
Elevated total cholesterol (>350 mg/dL) and/or triglycerides (>500 ng/dL) at time of possible conversion

Annotated entities:
- Measurement: "total cholesterol"
- Value: "Elevated"
- Value: ">350 mg/dL"
- Measurement: "triglycerides"
- Value: ">500 ng/dL"
- Temporal: "at time of possible conversion"